Clinical trial inclusion criterion:
Aspartate transaminase (AST) (SGOT) ≤ 2.5 X institutional ULN

Entity relations:
- Has_value("Aspartate transaminase (AST) (SGOT)", "≤ 2.5 X institutional ULN")